Attending provider excludes patient

The above is a clinical trial exclusion criterion. Annotated with entity spans:
[Non-representable: Attending provider excludes patient]